Clinical trial inclusion criterion:
Have measurable or evaluated disease based on RECIST 1.1 as determined by investigator.

Annotated entities:
- Non-query-able: "Have measurable or evaluated disease based on RECIST 1.1 as determined by investigator"